一位 35 歲女性病人因肉眼可見血尿就診。她沒有發燒或膀胱不適等症狀。家族史中，母親 65 歲死於尿毒症。理學檢查發現血壓為 150/100 mmHg，無貧血或黃疸；皮膚無異常，肝脾無腫大，但兩側 腎臟隱約可以摸到，下肢無水腫。有關此病人進一步的診斷或處理，下列何者最為正確？
A. 應做聽力檢查，診斷可能是阿頗特症候群（Alport syndrome）
B. 應做腎血管攝影，診斷可能是腎動脈高血壓（renovascular hypertension）
C. 應做超音波檢查，診斷可能是成人型多囊性腎病（polycystic kidney disease）
D. 應抽血檢查補體及抗核抗體，診斷可能是全身性紅斑性狼瘡（systemic lupus erythematosus）

正確答案：C. 應做超音波檢查，診斷可能是成人型多囊性腎病（polycystic kidney disease）